6. Ability to follow verbal or visual commands

The above is a clinical trial inclusion criterion. Annotated with entity spans:
[Parsing_Error: 6.] [Condition: Ability to follow verbal] or visual commands